Clinical trial exclusion criterion:
History of stroke within 3 months;

Entity relations:
- Has_value("stroke", "within 3 months")